Clinical trial inclusion criterion:
Diagnosis of chronic HCV infection, defined as positive HCV antibody or HCV RNA more than 6 months prior to screening OR an assessment of fibrosis F2 or greater prior to screening.

Annotated entities:
- Condition: "chronic HCV infection"
- Measurement: "HCV antibody"
- Value: "positive"
- Measurement: "HCV RNA"
- Temporal: "more than 6 months prior to screening"
- Reference_point: "screening"
- Measurement: "assessment of fibrosis"
- Value: "F2 or greater"
- Temporal: "prior to screening"
- Reference_point: "screening"